Clinical trial exclusion criterion:
Epileptiform EEG

Entity relations:
- Has_value("EEG", "Epileptiform")